關於醛固酮（aldosterone）分泌不足的生理變化，下列敘述何者錯誤？
A. 細胞外液之鉀離子濃度會顯	上升
B. 細胞外液體積會顯	減少
C. 心輸出量會顯	上升
D. 總血量會顯	降低

正確答案：C. 心輸出量會顯	上升